一名 2 天大之新生兒有明顯腹脹及嘔吐，照護者也陳述兩天來寶寶都沒有排出胎便；你幫寶寶做肛診時肛門是通的，只是手指進入時較緊，當手指移出肛門時有大量糞水隨著噴出。下列那一項檢查可用來幫此病人做確定診斷？
A. 腹部電腦斷層
B. 直腸 suction biopsy 病理切片檢查
C. 腹部超音波
D. 汗液試驗（sweat test）及囊性纖維化病（cystic fibrosis）之基因檢測

正確答案：B. 直腸 suction biopsy 病理切片檢查